一位 20 歲男性因運動後大腿無力至急診就醫。理學檢查血壓 128/88 mmHg，心跳 80/min，呼吸 mg/dL，AST 42 U/L，creatine kinase 410 U/L（正常值 60-400）；電解質（單位 mmol/L）：Na 140, K 2.3, Cl 112, Ca 2.25。對於此病人的進一步診斷，下列那個處置最合適？
A. 動脈血氣體分析
B. 心電圖
C. 胸部 X 光檢查
D. 肌電圖

正確答案：A. 動脈血氣體分析